Con objeto de comprobar la eficacia de un tratamiento para dejar de fumar se compara un grupo control (con placebo) con un grupo tratado. Para que los grupos sean comparables es importante que no difieran mucho en la edad de los participantes. Nos informan que la media de edad en el grupo control es 52 años y que en el grupo tratado también es 52 años. A partir de dicha información podemos decir que:
1. Los grupos no difieren respecto a la distribución de la variable edad.
2. Si el estudio está bien diseñado, no nos puede dar la misma media de edad en ambos grupos.
3. Para comparar la distribución de la variable edad en ambos grupos sería conveniente conocer una medida de dispersión como la desviación típica además de la media.
4. Para la conclusión final no importa la distribución de la edad en ambos grupos, sólo si el tratamiento es efectivo o no.
5. Si además de la media, coinciden la mediana y la moda podemos afirmar que los grupos no difieren respecto a la distribución de la variable edad.

Respuesta correcta: 3. Para comparar la distribución de la variable edad en ambos grupos sería conveniente conocer una medida de dispersión como la desviación típica además de la media.